Clinical trial exclusion criterion:
Severe renal impairment.

Entity relations:
- Has_qualifier("renal impairment", "Severe")